引起植入性胎盤（placenta accreta）最常見的危險因子為：
A. 人工流產手術
B. 子宮肌瘤切除手術
C. 前胎剖腹產合併前置胎盤
D. 高齡產婦

正確答案：C. 前胎剖腹產合併前置胎盤